T細胞受器（T cell receptor, TCR）向細胞內傳遞訊息主要依賴下列那一種分子？
A. TCR
B. MHC
C. CD2
D. CD3

正確答案：D. CD3